Clinical trial exclusion criterion:
Poorly regulated diabetes (>200 mg/dl (=11 mmol/l))

Annotated entities:
- Qualifier: "Poorly regulated"
- Condition: "diabetes"
- Qualifier: ">200 mg/dl (=11 mmol/l)"